Clinical trial inclusion criterion:
Clinical Diagnosis of PD based on the United Kingdom Brain Bank diagnostic criteria for PD.

Annotated entities:
- Condition: "PD"
- Measurement: "United Kingdom Brain Bank diagnostic criteria"